Clinical trial exclusion criterion:
reported heart condition

Annotated entities:
- Condition: "heart condition"